El troncoencéfalo o el tronco del encéfalo es la parte del Sistema Nervioso formada por:
1. El mesencéfalo, la protuberancia y el bulbo raquídeo.
2. La médula espinal y los 31 pares de nervios craneales.
3. El tálamo y la médula espinal.
4. El telencéfalo, con los hemisferios cerebrales.
5. El cuerpo calloso y el sistema límbico.

Respuesta correcta: 1. El mesencéfalo, la protuberancia y el bulbo raquídeo.